HIV infection at screening

The above is a clinical trial exclusion criterion. Annotated with entity spans:
[Condition: HIV infection] at screening